What is the Glasgow Coma score?

Glasgow coma sore is used to determine injury severity on admission to a hospital emergency department or by the duration of unconsciousness.